下列何者與骨骼肌細胞收縮無直接相關？
A. 副交感神經（parasympathetic nerve）
B. 運動終板（motor end plate）
C. 肌漿網（sarcoplasmic reticulum）
D. 橫小管（T-tubule）

正確答案：A. 副交感神經（parasympathetic nerve）